懷孕週數28週的早產兒，出生後五個月時至門診健康檢查。下列何種評估及建議最為正確？
A. 評估發展應該以兩個月年齡計算
B. 如果還不會抓握東西，表示細動作發展遲緩
C. 建議父母應該添加副食品
D. 建議開始使用學步車以促進粗動作發展

正確答案：A. 評估發展應該以兩個月年齡計算